從事醫院臨床工作者為避免遭受 B 型肝炎病毒的感染，常用的預防方法為何？
A. 施打 B 型肝炎疫苗
B. 注射干擾素
C. 注射 B 型肝炎免疫球蛋白
D. 主動感染 B 型肝炎病毒

正確答案：A. 施打 B 型肝炎疫苗